Estimated life expectancy of more than 12 weeks

The above is a clinical trial inclusion criterion. Annotated with entity spans:
[Observation: Estimated life expectancy] of [Value: more than 12 weeks]